Clinical trial inclusion criterion:
Population control :

Annotated entities:
- Not_a_criteria: "Population control :"
- Parsing_Error: "Population control :"